Clinical trial inclusion criterion:
Presence of at least 2 cryopreserved good quality cleavage-stage embryo (good quality cleavage-stage embryos display stage-specific cell division, have blastomeres of fairly equal size with few to no cytoplasmic fragments).

Entity relations:
- Has_qualifier("cleavage-stage embryo", "good quality")
- Has_qualifier("cleavage-stage embryo", "cryopreserved")
- Has_multiplier("cleavage-stage embryo", "at least 2")
- Has_qualifier("cleavage-stage embryos", "good quality")
- Has_qualifier("cleavage-stage embryos", "stage-specific cell division")
- Subsumes("cleavage-stage embryo", "cleavage-stage embryos")
- Has_qualifier("cleavage-stage embryos", "have blastomeres of fairly equal size")
- Has_qualifier("cleavage-stage embryos", "few to no cytoplasmic fragments")